De entre los 5 tipos de histonas de la cromatina, la de menor peso molecular es:
1. H2A.
2. H2B.
3. H1.
4. H4.
5. H3.

Respuesta correcta: 4. H4.